下列何者不由面神經所含之副交感神經纖維支配？
A. 淚腺
B. 鼻腔黏膜之腺體
C. 耳下腺
D. 下頜腺

正確答案：C. 耳下腺